Mujer 63 años, hipertensa. Al comenzar el tratamiento farmacológico empeoran sus valores glucémicos. El tratamiento farmacológico antihipertensivo que ha podido provocar esta situación será:
1. Fosfinopril.
2. Atenolol.
3. Hidroclorotiazida.
4. Valsartán.
5. Amlodipino.

Respuesta correcta: 3. Hidroclorotiazida.